有關停經後婦女的骨質疏鬆（osteoporosis）的敘述，下列何者錯誤？
A. 適度的鈣及維生素 D 補充有助於預防骨質疏鬆
B. 戒菸和戒酒可降低骨折的機率
C. 骨質疏鬆的定義為 Bone mineral density（BMD）之 T-score 介於-1～-2.5
D. 選擇性雌激素受體調節劑（selective estrogen receptor modulator）如 Raloxifene 已證實可治療骨質疏鬆

正確答案：C. 骨質疏鬆的定義為 Bone mineral density（BMD）之 T-score 介於-1～-2.5